History of chronic alcohol abuse and/or drug use;

The above is a clinical trial exclusion criterion. Annotated with entity spans:
History of [Qualifier: chronic] [Condition: alcohol abuse] and/or [Condition: drug use];